Provision of written consent

The above is a clinical trial inclusion criterion. Annotated with entity spans:
[Informed_consent: Provision of written consent]